一癲癇病人，自述其發作每次都是從右手開始抽動，很快的就傳至右上臂、右臉、然後再傳到右腳。 這個病人的癲癇病灶，最可能在下列左側大腦的那一個位置？
A. 額葉（frontal lobe）
B. 海馬回（hippocampus）
C. 視丘（thalamus）
D. 枕葉（occipital lobe）

正確答案：A. 額葉（frontal lobe）